What is the role of CD28 with respect to bacterial superantigen toxins?

cd28 is a homodimer expressed on t cells that functions as the principal costimulatory ligand in the immune response